Clinical trial inclusion criterion:
Have been smoking for at least one year

Entity relations:
- Has_temporal("smoking", "at least one year")